Slit lamp findings that would contraindicate contact lens wear such as:

The above is a clinical trial exclusion criterion. Annotated with entity spans:
[Parsing_Error: Slit lamp findings that would contraindicate contact lens wear such as:]